Clinical trial inclusion criterion:
Regular cycles

Annotated entities:
- Condition: "Regular cycles"